Clinical trial inclusion criterion:
Overweight or obesity (BMI =25 kg/m2)

Entity relations:
- Has_value("BMI", "=25 kg/m2")
- Subsumes("Overweight", "BMI")
- OR("Overweight", "obesity")